¿Cuáles de las siguientes estructuras están en contacto directo con la ventana oval a cada uno de sus lados?
1. El tímpano y la escala timpánica.
2. El estribo y la escala timpánica.
3. El martillo y la escala vestibular
4. El yunque y la escala timpánica.
5. El estribo y la escala vestibular.

Respuesta correcta: 5. El estribo y la escala vestibular.